Clinical trial exclusion criterion:
1. Renal insufficiency as an estimated GFR which is < 30 mL/min/1.7m2

Entity relations:
- Has_value("estimated GFR", "< 30 mL/min/1.7m2")
- AND("Renal insufficiency", "estimated GFR")